Clinical trial exclusion criterion:
History of symptomatic congestive heart failure, or ventricular arrhythmia requiring treatment.

Entity relations:
- Has_qualifier("congestive heart failure", "symptomatic")
- multi("requiring treatment", "treatment")
- Has_qualifier("ventricular arrhythmia", "requiring treatment")
- OR("congestive heart failure", "ventricular arrhythmia")